下列有關兒童「非器質性遺尿症」（nonorganic enuresis）之敘述，何者不正確？
A. 沒有器質性病因，仍會有尿床或尿褲子的狀況
B. 通常發生於睡眠中
C. 女童多於男童，且有明顯家族發生傾向
D. 患者與情緒、心理、壓力等因素相關

正確答案：C. 女童多於男童，且有明顯家族發生傾向